En el contraste estadístico     (chi cuadrado) la frecuencia teórica es:
1. La frecuencia esperada.
2. La frecuencia observada.
3. La diferencia entre la frecuencia observada y la esperada.
4. La frecuencia que se obtiene en la tabla de la distribución .

Respuesta correcta: 1. La frecuencia esperada.